Clinical trial exclusion criterion:
none, all patients meeting the inclusion criteria will be eligible.

Annotated entities:
- Non-representable: "none, all patients meeting the inclusion criteria will be eligible."